Evidence of severe or uncontrolled systemic diseases, including active bleeding diatheses or active infections including hepatitis B, C and Human Immunodeficiency Virus (HIV)

The above is a clinical trial exclusion criterion. Annotated with entity spans:
Evidence of [Qualifier: severe] or [Qualifier: uncontrolled] [Condition: systemic diseases], including [Condition: active bleeding diatheses] or [Condition: active infections] including [Condition: hepatitis B], C and [Condition: Human Immunodeficiency Virus (HIV)]